Primary or secondary infertility: tubal occlusion, male factor, unexplained, endometriosis, ovarian factors…

The above is a clinical trial inclusion criterion. Annotated with entity spans:
[Condition: Primary] or [Condition: secondary] infertility: [Condition: tubal occlusion], [Observation: male factor], [Observation: unexplained], [Condition: endometriosis], [Observation: ovarian factors]…